aged 18 or older,

The above is a clinical trial inclusion criterion. Annotated with entity spans:
[Person: aged] [Value: 18 or older],